Clinical trial inclusion criterion:
Uncomplicated RYGB performed minimum 3 months prior to the study.

Annotated entities:
- Procedure: "RYGB"
- Qualifier: "Uncomplicated"
- Temporal: "minimum 3 months prior to the study"
- Reference_point: "the study"